80 歲的陳老先生身體一向硬朗，行動自如、心智正常，最近經確診得到攝護腺癌，而且已經有骨轉移，泌尿科醫師建議進行手術及睪丸摘除，經向陳老先生解釋，陳老先生願意接受手術但拒絕摘除睪丸。陳老先生的兒子跟主治醫師要求手術麻醉後就一併摘除睪丸，反正陳老先生年紀也大了，留著睪丸用處不大，手術後他自然就會接受。主治醫師應該照著做嗎？
A. 應該，因為子女可以代為決定
B. 應該，因為對病情控制有幫助
C. 不應該，因為陳老先生的自主權應受到尊重
D. 不應該，因為陳老先生的兒子沒有簽手術同意書

正確答案：C. 不應該，因為陳老先生的自主權應受到尊重